Clinical trial inclusion criterion:
no previous exposure to etravirine

Entity relations:
- Has_temporal("etravirine", "previous")
- Has_negation("etravirine", "no")